Clinical trial exclusion criterion:
Subjects initiating new medications or patients on multiple medications may also be excluded.

Annotated entities:
- Non-query-able: "Subjects initiating new medications or patients on multiple medications may also be excluded."